口服避孕藥，不能保護下列何種病變的發生？
A. 卵巢癌
B. 子宮內膜癌
C. 良性乳房疾病
D. 子宮頸細胞變性（cervical dysplasia）

正確答案：D. 子宮頸細胞變性（cervical dysplasia）